標靶治療藥物rituximab合併化學治療已被證明可明顯延長下列何種病人的存活期？
A. diffuse large B cell lymphoma
B. peripheral T cell lymphoma
C. multiple myeloma
D. acute lymphoblastic leukemia

正確答案：A. diffuse large B cell lymphoma